Clinical trial inclusion criterion:
Translocation t(9;22) [BCR/ABL+] (Philadelphia chromosome-positive) or t(4;11) [MLL/AF4+].

Entity relations:
- Has_value("BCR/ABL", "+")
- Subsumes("BCR/ABL", "Translocation t(9;22)")
- Has_value("Philadelphia chromosome", "positive")
- Subsumes("MLL/AF4", "t(4;11)")
- Has_value("MLL/AF4", "+")
- Subsumes("BCR/ABL", "Philadelphia chromosome")
- OR("BCR/ABL", "MLL/AF4")